Clinical trial exclusion criterion:
The patients have allergic history or contraindication of tamoxifen.

Entity relations:
- AND("allergic", "tamoxifen")
- OR("allergic", "contraindication")